下列有關白蛉的敘述何者正確？
A. 大部分雌雄均會吸血
B. 因個體小故可隨氣流飛行很遠
C. 喜歡夜間吸血
D. 台灣沒有白蛉

正確答案：C. 喜歡夜間吸血